Uncontrolled hypertension defined as systolic >180 mmHg or > 160 mmHg on 2 consecutive measurements or diastolic > 100 mmHg on optimal medical regimen

The above is a clinical trial exclusion criterion. Annotated with entity spans:
[Condition: Uncontrolled hypertension] defined as [Measurement: systolic] [Value: >180 mmHg] or [Value: > 160 mmHg] [Multiplier: on 2 consecutive measurements] or [Measurement: diastolic] [Value: > 100 mmHg] [Qualifier: on optimal medical regimen]